Clinical trial exclusion criterion:
Any active respiratory, cardiovascular or other disease requiring regular treatment or being otherwise relevant for tolerance of hypoxia or altitude exposure.

Entity relations:
- Has_qualifier("disease", "other")
- Has_mood("treatment", "requiring")
- Has_mood("tolerance", "relevant being")
- AND("tolerance", "hypoxia")
- Has_qualifier("respiratory disease", "active")
- AND("respiratory disease", "treatment")
- AND("respiratory disease", "hypoxia")
- OR("respiratory disease", "disease", "cardiovascular disease")
- OR("hypoxia", "altitude exposure")